18 years of age or older

The above is a clinical trial inclusion criterion. Annotated with entity spans:
[Value: 18 years of] [Person: age] or older